Una reacción homogénea entre gases ideales que ha alcanzado el equilibrio químico puede evolucionar (es decir, desplazarse hacia la formación de mayor cantidad de reactivos o productos) de la siguiente forma si este equilibrio se altera:
1. Si se aumenta la temperatura a presión constante irá hacia donde se produzcan mayor número de moles.
2. Si se aumenta la presión a temperatura constante irá hacia donde el volumen sea mayor.
3. Si se añade un gas inerte irá hacia donde se consuma este gas.
4. Si se añade un gas que participa en la reacción irá hacia donde se produzca más cantidad de este gas.
5. Si se disminuye la temperatura irá hacia donde la reacción sea exotérmica.

Respuesta correcta: 5. Si se disminuye la temperatura irá hacia donde la reacción sea exotérmica.